全靜脈營養（TPN）使用一段時間後，常會導致病患的肝功能異常，這種病患的肝臟組織學變化不會有下列何種現象？
A. 膽汁鬱滯（Cholestasis）
B. 肝臟脂肪化（Hepatic steatosis）
C. 肝小葉有慢性發炎現象
D. 肝細胞大量壞死

正確答案：D. 肝細胞大量壞死